A diagnosis of sleep disordered breathing;

The above is a clinical trial exclusion criterion. Annotated with entity spans:
A diagnosis of [Condition: sleep disordered breathing];